Clinical trial exclusion criteria:
1. Had a neurological condition other than that associated with their pain diagnosis which, in the opinion of the investigator, would interfere with their ability to participate in the study
2. Were taking a lidocaine-containing product that could not be discontinued while receiving lidocaine
3. Were taking class 1 anti-arrhythmic drugs (e.g., mexiletine, tocainide)

Annotated entities:
- Condition: "neurological condition"
- Condition: "pain diagnosis"
- Negation: "other than"
- Qualifier: "associated with their pain diagnosis"
- Undefined_semantics: "in the opinion of the investigator"
- Drug: "lidocaine-containing product"
- Qualifier: "could not be discontinued"
- Temporal: "while receiving lidocaine"
- Drug: "lidocaine"
- Reference_point: "receiving lidocaine"
- Drug: "class 1 anti-arrhythmic drugs"
- Drug: "mexiletine"
- Drug: "tocainide"